一位40歲男性因疲倦及喘至門診求診。生命體徵血壓125/80 mmHg，心跳每分鐘85下且規律。室內空氣脈搏血氧飽和度(room air SpO2）98%。身體診察有右心室頂起（right ventricle heave），並於左側第二肋間可觸及收縮期顫抖（systolic thrill），且左側第二肋間可聽到收縮期心雜音。除此之外，也可聽到明顯且隨呼吸變化分裂第二心音（wide split second heart sound）。最可能之診斷為何？
A. 心房中隔缺損（atrial septal defect）
B. 主動脈狹窄（aortic stenosis）
C. 開放性動脈導管（patent ductus arteriosus）
D. 肺動脈瓣狹窄（pulmonary stenosis）

正確答案：D. 肺動脈瓣狹窄（pulmonary stenosis）